Clinical trial exclusion criterion:
History of tubal ligation or hysterectomy

Annotated entities:
- Procedure: "tubal ligation"
- Procedure: "hysterectomy"